下列何種影像學檢查對多發性骨髓癌（multiple myeloma）之診斷輔助最小？
A. 傳統 X 光片（conventional radiograph）
B. 骨骼核子掃描（bone scan）
C. 電腦斷層攝影（computerized tomography）
D. 磁振造影檢查（magnetic resonance imaging）

正確答案：B. 骨骼核子掃描（bone scan）